Need for chronic PN before study start

The above is a clinical trial exclusion criterion. Annotated with entity spans:
Need for [Procedure: chronic PN] [Temporal: before study start]